下列何種生理狀態，最可能使純水清除率（CH2O）成為負值？
A. 身體水分過多
B. 溶質清除率（COSM）減少
C. 腎小球濾過率（GFR）增加
D. 血中抗利尿激素（antidiuretic hormone）濃度增加

正確答案：D. 血中抗利尿激素（antidiuretic hormone）濃度增加